≥18 years of age undergoing open-heart surgery (sternotomy, including minimally-invasive sternotomies)

The above is a clinical trial inclusion criterion. Annotated with entity spans:
[Value: ≥18 years] of [Person: age] [Temporal: undergoing] [Procedure: open-heart surgery] ([Procedure: sternotomy], including [Procedure: minimally-invasive sternotomies])